下列何者不屬於病例對照研究設計（case-control study design）的特徵？
A. 相對於其他分析性流行病學研究設計，它相對較經濟
B. 是用回溯性的方法研究病因，因此常有偏差
C. 可以直接計算暴露組與對照組的疾病發生率
D. 研究結果可以用來計算可歸因危險性百分比

正確答案：C. 可以直接計算暴露組與對照組的疾病發生率